關於鉛（lead）中毒的相關症狀與病變，下列何者較不常見？
A. 溶血性貧血（hemolytic anemia）
B. 擴張性心肌病變（dilated cardiomyopathy）
C. 周邊神經脫髓鞘性病變（peripheral demyelinating neuropathy）
D. 痛風（gout）

正確答案：B. 擴張性心肌病變（dilated cardiomyopathy）